What is evaluated with the SAD PERSONS scale?

SAD PERSONS scale was developed to evaluate suicide risk.